Clinical trial exclusion criterion:
Patient with known liver disease or renal disease

Annotated entities:
- Condition: "liver disease"
- Condition: "renal disease"